Clinical trial inclusion criterion:
Patients are able to provide signed and dated written informed consent prior to any study specific procedures.

Annotated entities:
- Informed_consent: "Patients are able to provide signed and dated written informed consent prior to any study specific procedures."